What conditions are diagnosed using the scratch collapse test?

Scrap collapse test is used for the diagnosis of cts, cubital tunnel syndrome and carpal tunnel syndrome.